特異性免疫反應和非特異性免疫反應除了專一性外，下列何項也是二者的不同之處？
A. 記憶性
B. 執行特異性免疫反應除了有細胞外，還有可溶性的蛋白質幫忙
C. 區別自我與非自我抗原的能力
D. 可保護宿主不被病原菌侵犯

正確答案：A. 記憶性